Clinical trial exclusion criterion:
Obstructed outlet syndrome (objectified by defeacography)

Annotated entities:
- Condition: "Obstructed outlet syndrome"
- Procedure: "defeacography"